Clinical trial exclusion criterion:
Coronary or carotid artery disease likely to require surgical or percutaneous intervention within the 6 months.

Entity relations:
- Has_mood("surgical intervention", "likely")
- Has_temporal("surgical intervention", "within the 6 months")
- AND("Coronary artery disease", "surgical intervention")
- OR("surgical intervention", "percutaneous intervention")
- OR("Coronary artery disease", "carotid artery disease")